Past history of hypersensitivity to the study drug;

The above is a clinical trial exclusion criterion. Annotated with entity spans:
Past history of [Condition: hypersensitivity] to the [Drug: study drug];